Clinical trial inclusion criterion:
DSM-IV-TR major depressive disorder

Annotated entities:
- Qualifier: "DSM-IV-TR"
- Condition: "major depressive disorder"